able to consent

The above is a clinical trial inclusion criterion. Annotated with entity spans:
[Informed_consent: able to consent]